遺傳性非息肉症大腸直腸癌（hereditary nonpolyposis colon cancer, HNPCC）病患是在何種 DNA 修復功能上產生缺失？
A. 核苷酸切除修復（nucleotide excision repair）
B. 鹼基切除修復（base excision repair）
C. 重組修復（recombinational repair）
D. 核酸錯誤配對修復（mismatch repair）

正確答案：D. 核酸錯誤配對修復（mismatch repair）